Es muy común el empleo de válvulas rotatorias de 6 puertas o vías, conmutables alternadamente, para la inyección de muestras en cromatografía líquida de alta resolución. ¿Cuál de las siguientes respuestas es correcta?
1. En la posición de inyección, el fluyo de fase móvil se mantiene hacia la columna sin pasar por el bucle.
2. En la posición de carga, el bucle encargado de alojar la muestra permanece abierto a la atmósfera con lo que la muestra puede depositarse mediante una jeringa.
3. En la posición de carga, el flujo de fase móvil se mantiene hacia la columna pasando previamente por el bucle.
4. En la posición de carga, la muestra se inserta en la columna sin perturbar el paso de fase móvil hacia el bucle.
5. En la posición de inyección, todo el volumen interno del bucle se dirige al desecho mientras que la fase móvil arrastra la muestra.

Respuesta correcta: 2. En la posición de carga, el bucle encargado de alojar la muestra permanece abierto a la atmósfera con lo que la muestra puede depositarse mediante una jeringa.